known thromboembolic disease or with high risk of thromboembolism, warranting extra anticoagulation in connection with the procedure

The above is a clinical trial exclusion criterion. Annotated with entity spans:
known [Condition: thromboembolic disease] or with [Mood: high risk of] [Condition: thromboembolism], warranting [Procedure: extra anticoagulation] in connection with the procedure